Clinical trial exclusion criteria:
1) pregnancy, breast-feeding women, or female patients of childbearing potential but did not take contraceptive measures;2) existing severe acute infection and is not controlled; or purulent and chronic infection, delayed healing wounds; 3) the original severe heart disease, including congestive heart failure, uncontrolled high-risk arrhythmias, unstable angina, myocardial infarction, severe heart valve disease and resistant hypertension; 4) suffering from neurological and psychiatric diseases or mental disorders is not easy to control, poor compliance, and can not be described with treatment responders; primary brain or central nervous metastasis disease has not been controlled, with significant cranial hypertension or neuropsychiatric symptoms; 5) have bleeding tendencies; 6) other researchers believe that patients should not participate in the present trial.

Annotated entities:
- Line: "1) pregnancy, breast-feeding women, or female patients of childbearing potential but did not take contraceptive measures;"
- Line: "2) existing severe acute infection and is not controlled; or purulent and chronic infection, delayed healing wounds;"
- Line: "3) the original severe heart disease, including congestive heart failure, uncontrolled high-risk arrhythmias, unstable angina, myocardial infarction, severe heart valve disease and resistant hypertension;"
- Line: "4) suffering from neurological and psychiatric diseases or mental disorders is not easy to control, poor compliance, and can not be described with treatment responders; primary brain or central nervous metastasis disease has not been controlled, with significant cranial hypertension or neuropsychiatric symptoms;"
- Line: "5) have bleeding tendencies;"
- Line: "6) other researchers believe that patients should not participate in the present trial."
- Pregnancy_considerations: "pregnancy, breast-feeding women, or female patients of childbearing potential but did not take contraceptive measures;"
- Qualifier: "severe"
- Qualifier: "acute"
- Condition: "infection"
- Qualifier: "not controlled"
- Qualifier: "chronic"
- Qualifier: "purulent"
- Condition: "infection"
- Condition: "delayed healing wounds"
- Qualifier: "severe"
- Condition: "heart disease"
- Condition: "congestive heart failure"
- Qualifier: "uncontrolled"
- Qualifier: "high-risk"
- Condition: "arrhythmias"
- Condition: "unstable angina"
- Condition: "myocardial infarction"
- Qualifier: "severe"
- Condition: "heart valve disease"
- Qualifier: "resistant"
- Condition: "hypertension"
- Condition: "psychiatric diseases"
- Condition: "neurological diseases"
- Condition: "mental disorders"
- Condition: "poor compliance"
- Condition: "central nervous metastasis disease"
- Condition: "primary brain disease"
- Negation: "not"
- Qualifier: "controlled"
- Qualifier: "significant"
- Condition: "cranial hypertension"
- Condition: "neuropsychiatric symptoms"
- Condition: "bleeding tendencies"
- Non-query-able: "other researchers believe that patients should not participate in the present trial."